Women of childbearing age had to use a proven method to prevent pregnancy, before the surgical treatment.

The above is a clinical trial inclusion criterion. Annotated with entity spans:
[Person: Women] of [Observation: childbearing age] had to use a proven [Observation: method to prevent pregnancy], [Temporal: before the surgical treatment].